Clinical trial exclusion criterion:
Cardiac ischemia, cardiac arrhythmias or congestive heart failure uncontrolled by medication

Entity relations:
- Has_qualifier("congestive heart failure", "uncontrolled by medication")
- OR("Cardiac ischemia", "congestive heart failure", "cardiac arrhythmias")